Which genes have been found mutated in Gray platelet syndrome patients?

The genetic defects responsible for gray platelet syndrome are mutations in the genes NBEAL2, GATA1 and GFI1B.